=3 VT episodes within 24 hours

The above is a clinical trial inclusion criterion. Annotated with entity spans:
=[Multiplier: 3] [Condition: VT] episodes [Temporal: within 24 hours]